What is Hemochromatosis?

Hereditary hemochromatosis (HH) is a genetic disorder of iron metabolism that may lead to iron overload.